Clinical trial exclusion criterion:
Life expectancy less than 1year

Entity relations:
- Has_value("Life expectancy", "less than 1year")